¿Qué glándulas están situadas entre la piel y el músculo masetero, por delante y debajo del oído externo?
1. Glándulas parótidas.
2. Glándulas submandibulares.
3. Glándulas sublinguales.
4. Glándulas bucales.
5. Glándulas de Lieberkühn.

Respuesta correcta: 1. Glándulas parótidas.